下列真菌中最易侵犯腦組織的是：
A. 申克氏孢絲菌（Sporothrix schenckii）
B. 紅色毛癬菌（Trichophyton rubrum）
C. 卡氏肺孢菌（Pneumocystis carinii）
D. 新型隱球菌（Cryptococcus neoformans）

正確答案：D. 新型隱球菌（Cryptococcus neoformans）